Clinical trial exclusion criterion:
3. Ongoing pregnancy.

Entity relations:
- Has_temporal("pregnancy", "Ongoing")